Clinical trial exclusion criterion:
Patients who have had influenza vaccine in two of the three previous years

Entity relations:
- Has_temporal("influenza vaccine", "in two of the three previous years")